Previous coronary artery bypass graft surgery within the previous 6 months

The above is a clinical trial exclusion criterion. Annotated with entity spans:
[Temporal: Previous] [Procedure: coronary artery bypass graft surgery] [Temporal: within the previous 6 months]